Clinical trial exclusion criteria:
Current viral or bacterial infection.
Positive serology for HIV, HCV, HBV.

Annotated entities:
- Condition: "bacterial infection"
- Condition: "infection viral"
- Temporal: "Current"
- Measurement: "serology for HIV"
- Measurement: "serology for HCV"
- Measurement: "serology for HBV"
- Value: "Positive"